aged = 6 months

The above is a clinical trial inclusion criterion. Annotated with entity spans:
[Person: aged] [Value: = 6 months]